Diagnosis of type 2 diabetes (HbA1c > 48 mmol/mol)

The above is a clinical trial inclusion criterion. Annotated with entity spans:
Diagnosis of [Condition: type 2 diabetes] ([Measurement: HbA1c] [Value: > 48 mmol/mol])